History of alcohol or drug dependence or abuse

The above is a clinical trial exclusion criterion. Annotated with entity spans:
[Temporal: History] of [Condition: alcohol] or [Condition: drug dependence] or abuse